Clinical trial exclusion criterion:
Uncontrolled hypertension;

Annotated entities:
- Condition: "hypertension"
- Qualifier: "Uncontrolled"